Treated with conventional anti-depressant, administered within a formal psychiatric clinic or by a certified psychiatrist.

The above is a clinical trial inclusion criterion. Annotated with entity spans:
[Procedure: Treated] with [Drug: conventional anti-depressant], administered within a formal psychiatric clinic or by a certified psychiatrist.